Clinical trial inclusion criteria:
suspicion of nonfunctional P-NET on primary CT (i.e hypervascularity) or MRI
signed informed consent

Annotated entities:
- Condition: "nonfunctional P-NET"
- Mood: "suspicion"
- Procedure: "primary CT"
- Condition: "hypervascularity"
- Procedure: "MRI"
- Informed_consent: "signed informed consent"